3. Predicted adherence to the medication.

The above is a clinical trial inclusion criterion. Annotated with entity spans:
3. [Non-representable: Predicted adherence to the medication.]